Subarterial 型心室中隔缺損，因接近主動脈瓣的環部（annulus）常合併下列那一種併發症，以致於造成主動脈瓣逆流的現象？
A. 右冠狀動脈瓣（right coronary cusp）脫垂
B. 左冠狀動脈瓣（left coronary cusp）脫垂
C. 非冠狀動脈瓣（non coronary cusp）脫垂
D. 凡撒爾氏竇瘤（sinus valsalva aneurysm）之發生

正確答案：A. 右冠狀動脈瓣（right coronary cusp）脫垂